Clinical trial inclusion criterion:
Renal function, as follows: Creatinine <=1.5 x upper limit of normal (ULN).

Entity relations:
- Has_value("Creatinine", "<=1.5 x upper limit of normal (ULN)")